calculated creatinine clearance less than 60 mL per minute

The above is a clinical trial exclusion criterion. Annotated with entity spans:
[Measurement: calculated creatinine clearance] [Value: less than 60 mL per minute]